Patients requiring a primary total knee replacement

The above is a clinical trial inclusion criterion. Annotated with entity spans:
Patients requiring a [Procedure: primary total knee replacement]